Which domain of the MOZ/MYST3 protein complex associates with histone H3?

The double PHD finger domain of MOZ/MYST3 induces a-helical structure of the histone H3 tail to facilitate acetylation and methylation sampling and modification In addition to sampling H3 and H4 modification status, we show that the DPF cooperates with the MYST domain to promote H3K9 and H3K14 acetylation, although not if H3K4 is trimethylated